腎上腺皮質細胞不含下列何項構造？
A. 脂肪滴
B. 分泌顆粒
C. 粒線體
D. 平滑內質網

正確答案：B. 分泌顆粒